Clinical trial exclusion criterion:
Milk Protein Allergy: History of severe milk protein allergy.

Entity relations:
- Has_qualifier("milk protein allergy", "severe")
- Subsumes("Milk Protein Allergy", "milk protein allergy")